Clinical trial inclusion criterion:
Men and women aged > 18 years

Entity relations:
- Has_value("aged", "> 18 years")
- OR("Men", "women")